Clinical trial exclusion criteria:
Patients who are being prepared for surgery, or during or after surgery.
Patients with congenital anomalies, chromosomal anomalies, or heart defects.
Patients whose parents refuse to consent.

Annotated entities:
- Procedure: "surgery"
- Mood: "being prepared for"
- Temporal: "during surgery"
- Temporal: "after surgery"
- Condition: "congenital anomalies"
- Condition: "chromosomal anomalies"
- Condition: "heart defects"
- Non-query-able: "Patients whose parents refuse to consent."